陳小姐今年25歲，二年前開始左手會不自主甩動，接	是右手、臉部、及雙腳都會發生不自主動作（如擠眉弄眼、聳肩、扮鬼臉、彈指或舉腿等等），最後在身體各部位都出現，且愈來愈頻繁。一年前她也感覺到記憶力減低，常常打錯	。她的母親在48歲時也出現類似症狀，在55歲時自殺身亡。陳小姐的身體理學檢查正常，但其智力減低且易怒。她最可能的診斷是：
A. 亨丁頓舞蹈症（Huntington chorea）
B. 席登罕氏舞蹈症（Sydenham chorea）
C. 高甲狀腺亢進舞蹈症
D. 中風性半邊舞蹈症

正確答案：A. 亨丁頓舞蹈症（Huntington chorea）